Systolic blood pressure 90-140 mmHg

The above is a clinical trial inclusion criterion. Annotated with entity spans:
[Measurement: Systolic blood pressure] [Value: 90-140 mmHg]